Clinical trial exclusion criterion:
Patients allergic to lidocaine or other local anesthetics;

Annotated entities:
- Condition: "allergic"
- Drug: "lidocaine"
- Drug: "local anesthetics"
- Qualifier: "other"